Clinical trial exclusion criterion:
Body mass index (BMI) > 45 kg/m2.

Entity relations:
- Subsumes("Body mass index", "BMI")
- Has_value("Body mass index", "> 45 kg/m2")